What is carboxyglutamate?

One of the important glutamic acid modifications is post-translationally modified 4-carboxyglutamate.